Sensitive to the product or other genetically engineered biological products from Escherichia coli strains.

The above is a clinical trial inclusion criterion. Annotated with entity spans:
[Condition: Sensitive] to [Drug: the product] or [Qualifier: other] [Drug: genetically engineered biological products] from [Qualifier: Escherichia coli strains].